一個 55 歲女性，因偶然一次發現大便後擦拭肛門時有鮮血沾在衛生紙上，而去醫院接受大腸鏡檢查，結果發現在直腸和乙狀結腸接合處有一個 2 公分大小的有莖性息肉。經切除息肉後，病理報告為一個腺瘤且在息肉頸部靠近息肉莖部的地方合併有局部侵犯性的腺癌（Focal invasive cancer），若病人的一般狀況尚稱健康，則該如何處理最好？
A. 針對息肉基部再作更廣泛的內視鏡局部黏膜切除
B. 經肛門作更廣泛的息肉基部切除
C. 觀察追蹤就可以
D. 作直腸的前位切除術

正確答案：D. 作直腸的前位切除術